65 歲乾癬患者，最近因服用其他藥物，乾癬突然加劇，下列何種藥物和乾癬惡化最相關？
A. isosorbide mononitrate
B. atenolol
C. metformin
D. simvastatin

正確答案：B. atenolol